Which two drugs are included in the Harvoni pill?

Harvoni contains 400 mg sofosbuvir and 90 mg ledipasvir. It used for treatment of hepatitis C virus infection.